Concurrent potentially life threatening arrhythmia or symptomatic arrhythmia

The above is a clinical trial exclusion criterion. Annotated with entity spans:
Concurrent [Qualifier: potentially life threatening] [Condition: arrhythmia] or [Qualifier: symptomatic] [Condition: arrhythmia]